Clinical trial inclusion criterion:
Patients aged 7 years and older must have provided written assent accompanied by written informed consent from patient's representative

Annotated entities:
- Person: "aged"
- Value: "7 years and older"
- Post-eligibility: "must have provided written assent accompanied by written informed consent from patient's representative"